Clinical trial exclusion criterion:
TPED > 135° (Tubiana stage 4) in finger to be treated

Annotated entities:
- Measurement: "TPED"
- Value: "> 135°"
- Measurement: "Tubiana"
- Value: "stage 4"
- Qualifier: "finger to be treated"